Clinical trial exclusion criterion:
Endoscopically confirmed gastric and/or duodenal ulcers on Day 1.

Entity relations:
- multi("Endoscopically confirmed", "Endoscopically")
- multi("on Day 1", "Day 1")
- Has_qualifier("gastric", "Endoscopically confirmed")
- Has_temporal("gastric", "on Day 1")
- OR("gastric", "duodenal ulcers")